Presence of inflammatory arthropathy or neuropathy

The above is a clinical trial exclusion criterion. Annotated with entity spans:
Presence of [Condition: inflammatory arthropathy] or [Condition: neuropathy]